free from sleep apnea

The above is a clinical trial inclusion criterion. Annotated with entity spans:
[Negation: free from] [Condition: sleep apnea]